已知病人罹患嚴重類血友病（severe von Willebrand disease），無其他內科疾病，下列實驗室檢查結果何者屬不尋常？
A. prothrombin time 正常
B. PFA-100（platelet function analyzer 100）test 正常
C. activated partial thromboplastin time 輕微延長
D. von Willebrand factor ristocetin co-factor activity 明顯降低

正確答案：B. PFA-100（platelet function analyzer 100）test 正常